4. Diagnosis of HMB based on the medical judgment of the principal or site investigator

The above is a clinical trial inclusion criterion. Annotated with entity spans:
4. Diagnosis of [Condition: HMB] [Non-query-able: based on the medical judgment of the principal or site investigator]